Clinical trial exclusion criterion:
Scheduled major surgery in the next 6 months;

Annotated entities:
- Mood: "Scheduled"
- Procedure: "major surgery"
- Temporal: "in the next 6 months"